Preoperative radio- or chemotherapy;

The above is a clinical trial exclusion criterion. Annotated with entity spans:
[Temporal: Preoperative] radio- or [Procedure: chemotherapy];